Which disease is Dasatinib used to treat?

Dasatinib is a pan receptor tyrosine kinase inhibitor (RTK) used in the treatment of chronic myelogenous leukemia (CML).